Diagnosis of other functional diseases of the digestive system, such as dyskinesia of cystic duct or gallbladder, irritable bowel syndrome, etc.

The above is a clinical trial exclusion criterion. Annotated with entity spans:
Diagnosis of other [Condition: functional diseases] of the [Qualifier: digestive system], such as [Condition: dyskinesia of cystic duct] or gallbladder, [Condition: irritable bowel syndrome], etc.